Which are the components that evaluate druglikeness?

Lipinski's rule states that, in general, an orally active drug has no more than one violation of the following criteria:
No more than 5 hydrogen bond donors (the total number of nitrogen–hydrogen and oxygen–hydrogen bonds)
No more than 10 hydrogen bond acceptors (all nitrogen or oxygen atoms)
A molecular mass less than 500 daltons
An octanol-water partition coefficient (log P) that does not exceed 5